Clinical trial exclusion criterion:
Have other metallic artifacts/components in body that may interact with MRI

Entity relations:
- AND("interact", "MRI")
- AND("metallic components", "interact")
- AND("metallic artifacts", "interact")
- OR("metallic artifacts", "metallic components")